Previous participation in this study

The above is a clinical trial exclusion criterion. Annotated with entity spans:
[Temporal: Previous] [Observation: participation in this study]